下列疾病，何者不是引起嬰幼兒發生鬱血性心衰竭（congestive heart failure）的原因？
A. 左心到右心分流（left-to-right cardiac shunts）
B. 心室上心搏過速（supraventricular tachycardia）
C. 心肌炎（myocarditis）
D. 心內膜炎（endocarditis）

正確答案：D. 心內膜炎（endocarditis）